Clinical trial exclusion criterion:
Subjects who have been recently active (>30 min of moderate/high intensity exercise, 2 times/week).

Entity relations:
- Has_value("moderate/high intensity exercise", ">30 min")
- Has_multiplier("moderate/high intensity exercise", "2 times/week")
- Subsumes("active", "moderate/high intensity exercise")
- Has_temporal("active", "recently")